下列何者不會壓迫食道，形成生理性狹窄處而影響吞嚥？
A. 主動脈弓
B. 支氣管
C. 肺動脈
D. 橫膈

正確答案：C. 肺動脈